Clinical trial exclusion criterion:
History of corneal transplantation or recent intraocular surgery

Entity relations:
- OR("corneal transplantation", "intraocular surgery")